Doubtful availability to complete the study

The above is a clinical trial exclusion criterion. Annotated with entity spans:
[Post-eligibility: Doubtful availability to complete the study]